Clinical trial exclusion criterion:
<18 years of age

Annotated entities:
- Person: "age"
- Value: "<18 years"